下列那一頸部筋膜（fascia）位於舌骨下肌（infrahyoid muscles）後面，並覆蓋在甲狀腺（thyroid gland）表面？
A. 包圍層（investing layer）
B. 頸動脈鞘（carotid sheath）
C. 氣管前層（pretracheal layer）
D. 椎前層（prevertebral layer）

正確答案：C. 氣管前層（pretracheal layer）